下列關於固醇調節區域結合蛋白質（sterol regulatory element-binding protein；SREBP）之敘述，何者錯誤？
A. 位於內質網
B. 經由切斷連結的脂肪酸而活化
C. 活化後進入細胞核
D. 做為轉錄因子增加合成膽固醇（cholesterol）的基因表現

正確答案：B. 經由切斷連結的脂肪酸而活化